Clinical trial exclusion criterion:
Women who are pregnant (as evidenced by pregnancy test if pre-menopausal)

Annotated entities:
- Person: "Women"
- Condition: "pregnant"
- Procedure: "pregnancy test"
- Condition: "pre-menopausal"